一位 21 歲女性，因陰蒂肥大求診，被診斷為 congenital adrenal hyperplasia（CAH），其血中 ng/dL。下列關於 CAH 之病因及治療的敘述，何者最適當？
A. 最常見為 21-hydroxylase deficiency，治療最有效為 cortisone
B. 最常見為 11β-hydroxylase deficiency，治療最有效為 dexamethasone
C. 最常見為 21-hydroxylase deficiency，治療最有效為 dexamethasone
D. 最常見為 11β-hydroxylase deficiency，治療最有效為 cortisone

正確答案：C. 最常見為 21-hydroxylase deficiency，治療最有效為 dexamethasone